Liver cirrhosis,

The above is a clinical trial exclusion criterion. Annotated with entity spans:
[Condition: Liver cirrhosis],